Clinical trial exclusion criterion:
1. Personal history of stroke, brain lesions, previous neurosurgery, any personal history of seizure or fainting episode of unknown cause, or head trauma resulting in loss of consciousness, lasting over 30 minutes or with sequela lasting longer than two days.

Entity relations:
- Has_temporal("neurosurgery", "previous")
- Has_value("lasting", "longer than two days")
- AND("sequela", "lasting")
- Has_qualifier("head trauma resulting in loss of consciousness", "lasting over 30 minutes")
- Has_qualifier("fainting episode", "unknown cause")
- Has_temporal("seizure", "personal history of")
- Has_temporal("stroke", "history of")
- OR("lasting over 30 minutes", "sequela")
- OR("seizure", "head trauma resulting in loss of consciousness", "fainting episode")
- OR("stroke", "brain lesions", "neurosurgery")
- OR("stroke", "seizure")